Clinical trial exclusion criterion:
Has a spectacle cylinder ≥1.00D of cylinder in either eye.

Annotated entities:
- Device: "spectacle cylinder"
- Value: "≥1.00D"